La hipertensión arterial desarrollada en el hiperaldosteronismo se produce por:
1. Incremento de la calcemia.
2. Desensibilización de la pared vascular a los vasoconstrictores.
3. Mayor liberación de adrenalina y noradrenalina.
4. Incremento de la reabsorción de Na+ y H2O.
5. Disminución de la volemia.

Respuesta correcta: 4. Incremento de la reabsorción de Na+ y H2O.